Is a transplant recipient (except for corneal transplant).

The above is a clinical trial exclusion criterion. Annotated with entity spans:
Is a [Person: transplant recipient] ([Negation: except] for [Condition: corneal transplant]).